Clinical trial inclusion criterion:
30 min or more of (1) continuous clinical seizure activities or (2) recurrent seizure activities without recovery(returning to baseline)between seizures;

Entity relations:
- Has_temporal("seizure", "continuous")
- Has_temporal("seizure", "recurrent")
- OR("seizure", "without recovery", "seizure")